Clinical trial exclusion criterion:
Revision total knee arthroplasty

Annotated entities:
- Procedure: "Revision total knee arthroplasty"